下列止痛藥，何者的作用機制不是經由活化μ receptor？
A. nalbuphine
B. morphine
C. methadone
D. fentanyl

正確答案：A. nalbuphine